Healthy male or female adolescents, age 12 to 17 years (inclusive) at Screening, with a body mass index (BMI) that is greater than or equal to the United States-weighted mean of the 95th percentile based on age and sex with a body weight greater than 60 kilograms (kg). Participants with Type 2 diabetes mellitus (T2DM) may have a pre-existing or new diagnosis of T2DM.

The above is a clinical trial inclusion criterion. Annotated with entity spans:
[Condition: Healthy] [Person: male] or [Person: female] [Person: adolescents], [Person: age] [Value: 12 to 17 years] (inclusive) [Temporal: at Screening], with a [Measurement: body mass index (BMI)] that is [Value: greater than or equal to the United States-weighted mean of the 95th percentile] [Qualifier: based on age] and sex with a [Measurement: body weight] [Value: greater than 60 kilograms (kg)]. [Non-representable: Participants with Type 2 diabetes mellitus (T2DM) may have a pre-existing or new diagnosis of T2DM.]